Clinical trial exclusion criterion:
severe underlying illness, such as end stage renal disease, decompensated liver cirrhosis, or non-curative malignancy

Annotated entities:
- Condition: "severe underlying illness"
- Condition: "end stage renal disease"
- Condition: "liver cirrhosis"
- Qualifier: "decompensated"
- Condition: "malignancy"
- Qualifier: "non-curative"